scheduled for elective cesarean section.

The above is a clinical trial inclusion criterion. Annotated with entity spans:
[Mood: scheduled for] [Qualifier: elective] [Procedure: cesarean section].